Intention to perform primary percutaneous coronary intervention;

The above is a clinical trial inclusion criterion. Annotated with entity spans:
[Mood: Intention to perform] [Qualifier: primary] [Condition: percutaneous coronary intervention];